治療糖尿病酮酸中毒時，下列何者不是使用重碳酸鈉（bicarbonate）之適應症？
A. 心臟衰竭、呼吸衰竭、休克或昏迷
B. pH≤ 7.1
C. 重碳酸鈉<5 mEq/L
D. 低血鉀

正確答案：D. 低血鉀